下列關於astrocytes的敘述，何者正確？
A. 排列形成腦室壁（ventricular wall）之內襯細胞
B. 纏繞神經細胞之軸突（axon）以形成髓鞘（myelin sheath）
C. 幫助維持細胞外液中適當的鉀離子濃度
D. 大小與數目和神經元（neurons）相當

正確答案：C. 幫助維持細胞外液中適當的鉀離子濃度